Clinical trial inclusion criterion:
Diabetes

Annotated entities:
- Condition: "Diabetes"